Clinical trial exclusion criterion:
Evidence of drug and/or alcohol abuse (20g/day for women & 30g/day for men).

Annotated entities:
- Condition: "alcohol abuse"
- Condition: "drug abuse"
- Multiplier: "20g/day"
- Multiplier: "30g/day"
- Person: "men"
- Person: "women"